Clinical trial exclusion criterion:
History of delirium within the prior 3 months, epilepsy, stroke, dementia, psychotic disorder, or bipolar disorder

Entity relations:
- Has_temporal("delirium", "within the prior 3 months")
- OR("delirium", "bipolar disorder", "dementia", "stroke", "epilepsy", "psychotic disorder")